由於長時間擺位不當造成總腓神經（common fibular nerve）壓迫損傷，最常見的發生部位在下列何處？
A. 坐骨
B. 膝部外側
C. 外踝後緣
D. 內踝後緣

正確答案：B. 膝部外側